Clinical trial inclusion criterion:
Men and women 18-89 years old

Annotated entities:
- Person: "Men"
- Person: "women"
- Person: "old"
- Value: "18-89 years"